Scheduled for invasive coronary angiography

The above is a clinical trial inclusion criterion. Annotated with entity spans:
[Mood: Scheduled] for [Procedure: invasive coronary angiography]